Uno de los objetivos terapéuticos de los actuales modelos de tratamiento del Trastorno de Ansiedad Social/Fobia Social (Clark, 2001) es corregir la excesiva atención centrada en uno mismo y la imagen distorsionada de la propia ejecución que presentan muchos pacientes. ¿Qué técnica proponen Clark y Beck con este fin?:
1. La técnica de reestructuración de imágenes.
2. Video-feedback.
3. Recuerdo autobiográfico de amenazas sociales pasadas.
4. Meditación mindfunlness.

Respuesta correcta: 2. Video-feedback.